Clinical trial inclusion criterion:
3. Weighing at least 50 kg

Annotated entities:
- Parsing_Error: "3."
- Measurement: "Weighing"
- Value: "at least 50 kg"